Clinical trial exclusion criterion:
PGD patients

Annotated entities:
- Procedure: "PGD"